下列關於異位調節酵素（allosteric enzymes）的敘述，何者錯誤？
A. 異位調節因子（allosteric effector）會影響此類酵素活性中心的結構
B. 異位調節屬於可逆性（reversible）的活性調控方式
C. 此類酵素大多以單體（monomeric）的方式存在
D. 將此類酵素催化反應之初速度（Vo或Vi）對受質濃度（[S]）作圖，所得曲線呈S形

正確答案：C. 此類酵素大多以單體（monomeric）的方式存在